Women: (0.005835 x H3) + (15 x W) + 183 = TBV [H=height in inches; W=weight in pounds]

The above is a clinical trial inclusion criterion. Annotated with entity spans:
[Person: Women]: [Value: (0.005835 x H3) + (15 x W) + 183] = [Measurement: TBV] [H=height in inches; W=weight in pounds]